Clinical trial inclusion criteria:
history of significant bleeding (i.e. bleeding which required intervention or hospitalization), even in the absence of anticoagulation treatment at the time of the bleeding event, or
a cardioembolic event, which occurred on anticoagulation, or
a high risk profile of the patient, defined as a CHA2DS2-VASc score = 3 and a HAS-BLED score = 2

Annotated entities:
- Condition: "bleeding"
- Qualifier: "significant"
- Condition: "bleeding"
- Procedure: "intervention"
- Procedure: "hospitalization"
- Condition: "cardioembolic event"
- Drug: "anticoagulation"
- Temporal: "occurred on anticoagulation"
- Measurement: "CHA2DS2-VASc score"
- Value: "= 3"
- Measurement: "HAS-BLED score"
- Value: "= 2"
- Condition: "high risk profile"